What is another name for  keratomileusis?

Report the outcomes of laser in situ keratomileusis (LASIK) for high myopia correction after long-term follow-up